與牛奶共服，不但影響吸收，而且會使藥物失去抗菌活性的抗生素為：
A. Ampicillin
B. Tetracycline
C. Erythromycin
D. Cephalexin

正確答案：B. Tetracycline